Desire for conception in the next 12 months

The above is a clinical trial exclusion criterion. Annotated with entity spans:
[Mood: Desire] for [Observation: conception] [Temporal: in the next 12 months]